肥胖是脂肪過多的疾病。關於脂肪組織之脂肪代謝，下述何者錯誤？
A. 釋放出來的脂肪酸部分可供給其他組織生產能量
B. 釋放出來的脂肪酸可送到肝臟內再合成三酸甘油酯，所以肥胖病患易合併脂肪肝
C. 空腹時，釋放出來的脂肪酸送到肝臟內合成三酸甘油酯，包裝成低密度脂蛋白（low-density lipoprotein）分泌至血液中
D. 釋放出來的脂肪酸，大部分在脂肪組織內及肝臟內再合成三酸甘油酯

正確答案：C. 空腹時，釋放出來的脂肪酸送到肝臟內合成三酸甘油酯，包裝成低密度脂蛋白（low-density lipoprotein）分泌至血液中